7. History of alcohol abuse or use of any illicit drugs

The above is a clinical trial exclusion criterion. Annotated with entity spans:
[Parsing_Error: 7.] History of [Condition: alcohol abuse] or [Condition: use of] any illicit drugs